一位 25 歲男性在修築高架橋時，不慎跌落，經送往急診室，理學檢查顯示生命跡象穩定，意識清楚，但發現兩下肢肌力為 0 分，沒有任何感覺，且無任何下肢深層肌腱反射（deep tendon reflex），X 光檢查發現第八胸椎骨折。對於其下肢神經功能恢復預後評估上，最重要的檢查是下列何者？
A. 陰莖球海綿體肌反射（bulbocavernous reflex）檢查
B. 肌電圖（electromyograms）及神經傳導檢查（nerve conduction studies）
C. 脊髓造影（myelography）檢查
D. 正面及側面全脊椎 X 光（whole spine X-ray）檢查

正確答案：A. 陰莖球海綿體肌反射（bulbocavernous reflex）檢查